Clinical trial exclusion criterion:
patients with severe allergic constitution, or those who are allergic to or intolerant of drug composition in chemotherapy regimens; with other malignant tumors in the past 5 years;

Annotated entities:
- Condition: "allergic"
- Qualifier: "severe"
- Condition: "allergic"
- Condition: "intolerant"
- Procedure: "chemotherapy regimens"
- Qualifier: "other"
- Condition: "malignant tumors"
- Temporal: "past 5 years"